Clinical trial exclusion criterion:
Recent myocardial infarction (within the last 3 months)

Entity relations:
- Has_temporal("myocardial infarction", "the last 3 months")